乳頭的柏德氏疾病（Paget's disease）是源於：
A. 乳頭皮膚
B. 乳頭的乳管
C. 乳腺
D. 乳腺間的纖維組織

正確答案：B. 乳頭的乳管